Over 18 years of age; Systemically healthy; Non-smoking;

The above is a clinical trial inclusion criterion. Annotated with entity spans:
[Value: Over 18 years] of [Person: age]; [Condition: Systemically healthy]; [Condition: Non-smoking];